Clinical trial exclusion criterion:
Congenital eye malformations in the study eye.

Annotated entities:
- Condition: "Congenital eye malformations"
- Qualifier: "in the study eye"